Use of female hormonal products based on estrogen or derivatives

The above is a clinical trial exclusion criterion. Annotated with entity spans:
Use of [Drug: female hormonal products] based on [Qualifier: estrogen] or derivatives